Which R/Bioconductor package has been developed for gene expression signature searching?

SignatureSearch is an R/Bioconductor package that integrates a suite of existing and novel algorithms into an analysis environment for gene expression signature (ANS) searching combined with functional enrichment analysis (FEA) and visualization methods to facilitate the interpretation of the search results.